Clinical trial exclusion criterion:
Use of oral steroids for no greater than 14 days given for a non-MS condition is not exclusionary.

Annotated entities:
- Drug: "oral steroids"
- Temporal: "no greater than 14 days"
- Condition: "non-MS condition"
- Negation: "not"
- Non-representable: "Use of oral steroids for no greater than 14 days given for a non-MS condition is not exclusionary."